48 歲男性，慢性 B 型肝炎約有數十年，近幾個月來體重下降，疲倦至門診就診，血液及生化檢查結果為血小板 35,000 /μL，INR: 1.2，AST: 45 U/L，T.Bil: 1.2 mg/dL，Alb: 3.6 g/dL，AFP: 562 ng/mL，超音波檢查發現左肝第三節有一陰影，進而電腦斷層檢查發現此病灶為 3.5 公分，hypervascular 位於第三肝節表面，無血管侵犯現象，周圍邊緣完整無腹水另外發現脾腫大 15 公分。請問接下來的處置何者最適宜？
A. 若 ICG15 retention 檢查為 38%，可行左肝第 2、3、4 節切除
B. 若 ICG15 retention 檢查為 15%，可行左肝第 2、3、4 節及脾切除
C. 若 ICG15 retention 檢查為 38%，血管攝影發現 AV shunting，最好做血管栓塞治療
D. 若 ICG15 retention 檢查為 15%，只須考慮肝動脈栓塞術不考慮手術治療

正確答案：B. 若 ICG15 retention 檢查為 15%，可行左肝第 2、3、4 節及脾切除